Non-smoking

The above is a clinical trial inclusion criterion. Annotated with entity spans:
[Negation: Non]-[Condition: smoking]